Clinical trial exclusion criterion:
Cannot understand English, Cantonese or Putonghua

Annotated entities:
- Non-query-able: "Cannot understand English, Cantonese or Putonghua"